Clinical trial exclusion criterion:
Person who weighs less than 50kg.

Entity relations:
- Has_value("weighs", "less than 50kg")